Diagnosis of MDD (Major Depressive Disorder), made or affirmed by a senior psychiatrist in Shalvata

The above is a clinical trial inclusion criterion. Annotated with entity spans:
Diagnosis of [Condition: MDD] ([Condition: Major Depressive Disorder]), made or affirmed by a senior psychiatrist in Shalvata